一位 45 歲男性病患，因接受左大腸切除後第 10 天發生吻合處漏失，腹部引流管流出腸液。病人呈現腹脹，但無明顯發燒及全腹膜炎之症狀。此時下列有關之處置何項較不適當？
A. 繼續給與抗生素注射
B. 繼續禁食及鼻胃管減壓
C. 給與全靜脈營養注射
D. 立即安排再開腹手術

正確答案：D. 立即安排再開腹手術